Patients with active systemic infection that requires the continued administration of antibiotics.

The above is a clinical trial exclusion criterion. Annotated with entity spans:
Patients with [Qualifier: active] [Condition: systemic infection] that requires the [Multiplier: continued administration] of [Drug: antibiotics].